Clinical trial inclusion criteria:
Presents to the Emergency Department (ED) and meets the clinical definition for Acute Bacterial Skin and Skin Structure Infections (ABSSSI)
Known or suspected gram-positive infection.

Annotated entities:
- Visit: "Emergency Department (ED)"
- Measurement: "Acute Bacterial Skin and Skin Structure Infections"
- Measurement: "ABSSSI"
- Qualifier: "gram-positive"
- Condition: "infection"